下列關於胰臟神經內分泌腫瘤之敘述，何者錯誤？
A. 胰臟功能性神經內分泌腫瘤以胰島素瘤（insulinoma）最多
B. insulinoma的Whipple's triad診斷包括：低血糖，因低血糖出現的症狀及給與葡萄糖後症狀立刻緩解三項
C. insulinoma大部分是hypovascularity。在contrast enhanced CT下，易形成完全低顯影的腫塊影像
D. 發生率男、女性差不多

正確答案：C. insulinoma大部分是hypovascularity。在contrast enhanced CT下，易形成完全低顯影的腫塊影像